下列何種情況不會增加胎兒發生 congenital malformation 之機會？
A. 孕婦有癲癇病史並服用抗癲癇藥物以防止癲癇發作
B. 孕婦有幼年型糖尿病
C. 先生有平衡型染色體轉位
D. 先生曾經接受過癌症化學治療

正確答案：D. 先生曾經接受過癌症化學治療